La espectroscopia de infrarrojo proporciona indicios sobre el tipo específico de grupo carbonilo presente en los derivados de ácido carboxílico. Una banda de absorción a 1650 cm-1 es compatible con la estructura de:
1. Cloruro de benzoílo.
2. N,N-dimetilacetamida.
3. Cloruro de acetilo.
4. Benzoato de etilo.

Respuesta correcta: 2. N,N-dimetilacetamida.